氣喘的治療在這幾年來又有進步，下列有關藥物的敘述何者為真？
A. 抗膽鹼（anti-cholinergic）藥物的主要作用是抑制發炎反應
B. 患者只要接受一次抗-IgE 抗體的治療就不會再發作
C. 白三烯素-調節藥物（leukotriene-modifying agents）同時具有抗發炎和氣管擴張的效果
D. 吸入性類固醇即使用到最高劑量，在氣喘患童也不會導致任何副作用

正確答案：C. 白三烯素-調節藥物（leukotriene-modifying agents）同時具有抗發炎和氣管擴張的效果